What are Degrons?

Specific signals (degrons) regulate protein turnover mediated by the ubiquitin-proteasome system.